Clinical trial inclusion criterion:
Hospitalised children aged 3-mo to 5-yrs (in Darwin, children have to be Indigenous)

Annotated entities:
- Visit: "Hospitalised"
- Person: "children"
- Person: "aged"
- Value: "3-mo to 5-yrs"